With which cancers has the loss of SMARCB1 been associated?

Loss of SMARCB1/INI1 expression is considered to be a hallmark for childhood chordomas (CCs).